Clinical trial inclusion criterion:
IDU with report of using previously used or shared needles in past 6 months or has been in a methadone, buprenorphine, or suboxone treatment program in past 6 months or engaging in high-risk sexual behaviors

Entity relations:
- Has_temporal("using previously used or shared needles", "in past 6 months")
- AND("treatment program", "methadone")
- Has_temporal("treatment program", "in past 6 months")
- OR("methadone", "buprenorphine", "suboxone")
- OR("using previously used or shared needles", "treatment program", "engaging in high-risk sexual behaviors")